Clinical trial inclusion criterion:
=2 risk factors: diabetes mellitus, age =70 years, BMI =30, fascial enlargement

Annotated entities:
- Multiplier: "=2"
- Condition: "risk factors"
- Condition: "diabetes mellitus"
- Person: "age"
- Value: "=70 years"
- Measurement: "BMI"
- Value: "=30"
- Condition: "fascial enlargement"